Clinical trial exclusion criteria:
Uncontrolled hypertension or metabolic disease
Neurodegenerative disorders (i.e. Parkinson disease. LBD, or FTD).
Dementia or Mild cognitive impairment at baseline
Long life major depression. Baseline scores =16 on the 17-item Hamilton Depression Scale at baseline.
Long-life DSM-IV axis 1 disorders.
Mental retardation.
Substance abuse.
Concurrent medication limiting validity of neuropsychological tests or imaging.
Anti-depressants with anti-cholinergic properties
Monoamine oxidase inhibitors (MAOi)
Regular use of narcotic analgesics (>2 doses per week).
Use of neuroleptics
Use of anti-dementia medications (Aricept, Exelon, Razadyne) and memantine (Namenda)) or anti-Parkinsonian medications (Sinemet, amantadine, bromocriptine, pergolide, selegeline).
Individuals taking over the counter memory enhancing or protecting medications (e.g. ginkgo biloba, vitamins) are not excluded.
Implanted medical devices that are incompatible with MRI imaging.
Radiation exposures exceeding annual Rad Worker limits.
Heart failure stage D as defined by American Heart Association (7).
Chronic kidney disease in stages = 4, as defined per National Kidney Foundation (8).
Brain tumor and other neoplastic disorders outside the brain where disease itself or its treatment (radiation, chemotherapy) is likely to affect brain structure or function.
Stroke when meeting criteria for total anterior, partial anterior or posterior circulation infarct according to the Oxford Community Stroke Project classification. Patients with clinically silent of lacunar strokes and transient ischemic attacks will not be excluded.
Significant head trauma.
Hydrocephalus.
Hostility or refusal to cooperate

Annotated entities:
- Condition: "hypertension"
- Condition: "metabolic disease"
- Qualifier: "Uncontrolled"
- Condition: "Neurodegenerative disorders"
- Condition: "Parkinson disease"
- Condition: "LBD"
- Condition: "FTD"
- Condition: "Dementia"
- Condition: "Mild cognitive impairment"
- Measurement: "cognitive impairment"
- Value: "Mild"
- Temporal: "at baseline"
- Condition: "Long life major depression"
- Measurement: "Baseline scores"
- Value: "=16"
- Measurement: "17-item Hamilton Depression Scale"
- Temporal: "at baseline"
- Reference_point: "baseline"
- Condition: "Long-life DSM-IV axis 1 disorders"
- Condition: "Mental retardation"
- Condition: "Substance abuse"
- Temporal: "Concurrent"
- Drug: "medication"
- Qualifier: "limiting validity of neuropsychological tests"
- Qualifier: "limiting validity of imaging"
- Drug: "Anti-depressants"
- Qualifier: "anti-cholinergic properties"
- Drug: "anti-cholinergic"
- Drug: "Monoamine oxidase inhibitors (MAOi)"
- Drug: "narcotic analgesics"
- Multiplier: ">2 doses per week"
- Multiplier: "Regular use"
- Drug: "neuroleptics"
- Drug: "anti-dementia medications"
- Drug: "Aricept"
- Drug: "Exelon"
- Drug: "Razadyne"
- Drug: "memantine"
- Drug: "Namenda"
- Drug: "anti-Parkinsonian medications"
- Drug: "Sinemet"
- Drug: "amantadine"
- Drug: "bromocriptine"
- Drug: "pergolide"
- Drug: "selegeline"
- Drug: "over the counter memory enhancing medications"
- Drug: "over the counter memory protecting medications"
- Drug: "ginkgo biloba"
- Drug: "vitamins"
- Non-representable: "Individuals taking over the counter memory enhancing or protecting medications (e.g. ginkgo biloba, vitamins) are not excluded."
- Device: "medical devices"
- Procedure: "MRI imaging"
- Qualifier: "incompatible with MRI imaging"
- Measurement: "Radiation exposures"
- Value: "exceeding annual Rad Worker limits"
- Condition: "Heart failure"
- Measurement: "stage"
- Value: "D"
- Qualifier: "American Heart Association"
- Condition: "Chronic kidney disease"
- Measurement: "stages"
- Value: "= 4"
- Qualifier: "National Kidney Foundation"
- Condition: "Brain tumor"
- Condition: "neoplastic disorders"
- Qualifier: "outside the brain"
- Qualifier: "likely to affect brain structure"
- Qualifier: "likely to affect brain function"
- Procedure: "radiation"
- Procedure: "chemotherapy"
- Condition: "Stroke"
- Condition: "circulation infarct"
- Qualifier: "posterior"
- Qualifier: "total anterior"
- Qualifier: "partial anterior"
- Measurement: "Oxford Community Stroke Project classification"
- Non-representable: "Patients with clinically silent of lacunar strokes and transient ischemic attacks will not be excluded."
- Qualifier: "Significant"
- Condition: "head trauma"
- Condition: "Hydrocephalus"
- Observation: "refusal to cooperate"
- Observation: "Hostility"